Clinical trial inclusion criterion:
Patients with bilateral age related cataracts, require bilateral cataract phacoemulsification combined Intraocular Lens implantation;

Entity relations:
- Has_qualifier("cataracts", "age related")
- Has_qualifier("cataracts", "bilateral")
- Has_qualifier("cataract phacoemulsification", "bilateral")
- Has_qualifier("Intraocular Lens implantation", "bilateral")